Which is the most common cause of sudden cardiac death in young athletes?

the most common cause of sudden cardiac death in young athletes is hypertrophic cardiomyopathy